Clinical trial exclusion criterion:
Patients having earned more than 4500€ in indemnities for participation in clinical trials during the previous 12 months, including this study.

Annotated entities:
- Competing_trial: "participation in clinical trials"
- Temporal: "during the previous 12 months"
- Reference_point: "the previous 12 months"
- Observation: "earned more than 4500€ in indemnities"
- Non-query-able: "earned more than 4500€ in indemnities"